Clinical trial exclusion criteria:
pregnant
30 min or more of moderate to vigorous activity more than 3 times per week
cardiovascular disease
physical limitations that might be aggravated by moderate physical activity
planning to move in next 12-24 months
diabetic

Annotated entities:
- Condition: "pregnant"
- Observation: "moderate to vigorous activity"
- Multiplier: "more than 3 times per week"
- Multiplier: "30 min or more"
- Condition: "cardiovascular disease"
- Condition: "physical limitations"
- Qualifier: "aggravated by physical activity"
- Qualifier: "moderate"
- Mood: "planning to move"
- Temporal: "in next 12-24 months"
- Condition: "diabetic"